Pregnancy related conditions.

The above is a clinical trial exclusion criterion. Annotated with entity spans:
[Qualifier: Pregnancy related] [Condition: conditions].